Clinical trial inclusion criterion:
birthweight greater than 2.4 kg

Annotated entities:
- Measurement: "birthweight"
- Value: "greater than 2.4 kg"